Clinical trial exclusion criterion:
Patients' age less than 65 years;

Entity relations:
- Has_value("age", "less than 65 years")